Clinical trial exclusion criterion:
Clinically significant, symptomatic cardiovascular disease, New York Heart Association (NYHA) Grade II or greater congestive heart failure, serious cardiac arrhythmia, Grade II or greater peripheral vascular disease, or history of major heart surgery within 6 months of Day 1, or any situation that would likely limit compliance with study requirements

Entity relations:
- Has_qualifier("cardiovascular disease", "symptomatic")
- Has_qualifier("cardiovascular disease", "Clinically significant")
- Has_value("New York Heart Association (NYHA)", "Grade II or greater")
- AND("congestive heart failure", "New York Heart Association (NYHA)")
- Has_qualifier("cardiac arrhythmia", "serious")
- Has_qualifier("heart surgery", "major")
- Has_temporal("heart surgery", "history of")
- Has_index("within 6 months of Day 1", "Day 1")
- Has_temporal("peripheral vascular disease", "within 6 months of Day 1")
- Has_temporal("limit compliance", "within 6 months of Day 1")
- OR("peripheral vascular disease", "heart surgery")